What is caused by gain-of-function variants in SYK?

Gain-of-function variants in SYK cause immune dysregulation and systemic inflammation in humans and mice.